Life expectancy of less than one year

The above is a clinical trial exclusion criterion. Annotated with entity spans:
L[Observation: ife expectancy] of [Value: less than one year]